下列何者不連接於子宮體的兩側？
A. 卵巢韌帶（ovary ligament）
B. 子宮圓韌帶（round ligament of the uterus）
C. 闊韌帶（broad ligament）
D. 主韌帶（cardinal ligamnet）

正確答案：D. 主韌帶（cardinal ligamnet）